膀胱主要被腹膜覆蓋的部分是：
A. 後面
B. 側下面
C. 上表面
D. 膀胱頸

正確答案：C. 上表面